Respecto a los factores psicosociales relacionados con el cáncer, se ha comprobado que las personas mejoran sus probabilidades de supervivencia si:
1. Inhiben la manifestación de emociones negativas.
2. Aceptan pasivamente el diagnóstico.
3. Aprenden a expresar sus emociones negativas.
4. Presentan unas características de personalidad independiente y responsable.

Respuesta correcta: 3. Aprenden a expresar sus emociones negativas.